Clinical trial inclusion criterion:
Those that meet the ACR 1990 and 2010 criteria for Fibromyalgia.

Entity relations:
- Has_qualifier("Fibromyalgia", "ACR 1990")
- Has_qualifier("Fibromyalgia", "ACR 2010")